Patients with Non-androgenetic causes of hair loss.

The above is a clinical trial exclusion criterion. Annotated with entity spans:
Patients with [Condition: Non-androgenetic causes of hair loss].